與 HNPCC（hereditary nonpolyposis colorectal cancer）syndrome 之形成有關的是下列那一項？
A. APC gene
B. MMR（mismatch-repair）gene mutations
C. p53 mutation
D. RAS mutation

正確答案：B. MMR（mismatch-repair）gene mutations